34 歲已婚女性，罹患腦下垂體泌乳激素瘤（prolactinoma），規則以藥物治療可維持正常生理週期。 最近病患主訴 6 週無月經，合併噁心、嘔吐。則此時應建議先作那項荷爾蒙檢查？
A. 尿液中之人體絨毛膜性促素（hCG）
B. 泌乳激素（prolactin）
C. 甲促素（TSH）
D. 收集 24 小時尿液中之腎上腺皮質荷爾蒙（cortisol）

正確答案：A. 尿液中之人體絨毛膜性促素（hCG）